關於胃癌之敘述，下列何者錯誤？
A. Borrmann第三型胃癌（Borrmann type 3）是指潰瘍型胃癌合併胃壁侵犯（ulcerating lesions with
B. 腸型（intestinal type）胃癌較常為分化良好胃癌（well differentiated），且轉移方式較常為血液轉移
C. 瀰漫型（diffuse-type）胃癌在高發生率區域較腸型（intestinal-type）胃癌為多，且預後較差
D. APC（adenomatous polyposis coli）gene mutation（基因突變）較常發生在腸型（intestinal type）胃癌

正確答案：C. 瀰漫型（diffuse-type）胃癌在高發生率區域較腸型（intestinal-type）胃癌為多，且預後較差